Stable concomitant Disease Modifying Anti-Rheumatic Drugs (DMARDs)

The above is a clinical trial inclusion criterion. Annotated with entity spans:
[Multiplier: Stable] [Temporal: concomitant] [Drug: Disease Modifying Anti-Rheumatic Drugs (DMARDs)]